HIV negative or status unknown (as from the Ante-natal card)

The above is a clinical trial inclusion criterion. Annotated with entity spans:
[Condition: HIV] [Negation: negative] or [Qualifier: status unknown] (as from the Ante-natal card)